If Diabetes is present

The above is a clinical trial exclusion criterion. Annotated with entity spans:
If [Condition: Diabetes] is present